What disease is associated with a Malar rash?

Malar rash is associated with a disease of the skin called Systemic lupus erythematosis.